Clinically significant pulmonary disease.

The above is a clinical trial exclusion criterion. Annotated with entity spans:
[Qualifier: Clinically] significant [Condition: pulmonary disease].